Age>18 years

The above is a clinical trial inclusion criterion. Annotated with entity spans:
[Person: Age][Value: >18 years]